¿Cuál es la fase descrita por Kübler-Ross en su teoría sobre el afrontamiento de la muerte que suele ser reacción inicial ante la expectativa de la muerte?:
1. Depresión.
2. Ira o enojo.
3. Negociación.
4. Aceptación.
5. Negación.

Respuesta correcta: 5. Negación.